Clinical trial inclusion criteria:
Adults over 18 years of age
Symptomatic GSV or SSV vein reflux > 0.5 seconds on colour Duplex
Varicose vein tributary requiring treatment

Annotated entities:
- Person: "Adults"
- Value: "over 18 years of age"
- Person: "age"
- Condition: "GSV vein reflux"
- Condition: "SSV vein reflux"
- Qualifier: "> 0.5 seconds"
- Procedure: "colour Duplex"
- Qualifier: "Varicose vein tributary"
- Mood: "requiring"
- Procedure: "treatment"